Clinical trial exclusion criterion:
Patients with keloids on the intended biopsy site

Entity relations:
- Has_qualifier("keloids", "on the intended biopsy site")